Clinical trial exclusion criterion:
Prolonged use (more than 14 days) immunosuppressants or other immunosuppressive drugs within 6 months prior to the start of the study;

Entity relations:
- Subsumes("Prolonged use", "more than 14 days")
- Has_qualifier("immunosuppressive drugs", "other")
- Has_temporal("immunosuppressants", "Prolonged use")
- Has_temporal("immunosuppressants", "within 6 months prior to the start of the study")
- OR("immunosuppressants", "immunosuppressive drugs")